Development of pathological Q waves on ECG.

The above is a clinical trial inclusion criterion. Annotated with entity spans:
Development of [Condition: pathological Q waves] on [Procedure: ECG].